Clinical trial inclusion criterion:
BMI 25-35 kg/m2,

Annotated entities:
- Measurement: "BMI"
- Value: "25-35 kg/m2"